Previous known hypersensitivity to tetracyclines

The above is a clinical trial exclusion criterion. Annotated with entity spans:
[Temporal: Previous] known [Condition: hypersensitivity] to [Drug: tetracyclines]